Which proteins does the yeast Cleavage and Polyadenylation Complex contain?

The proteins Nrd1, Rap1, Trf4, Rrp6, Ssu72, Cstf64, Pcf11 and PAP are the major components of the 3' cleavage and polyadenylation complex.